Lobar and sublobar resections

The above is a clinical trial inclusion criterion. Annotated with entity spans:
[Procedure: Lobar] and [Procedure: sublobar resections]